50歲男性，體重70公斤，被熱水燙傷造成頭頸部、胸部及背部約40%面積的二	燙傷，被送往急診室接受治療，下列處置何者不適當？
A. 依Parkland公式前8小時給予5.6公升的林格氏乳酸液
B. 給予烤燈避免低體溫
C. 可給予白蛋白（albumin）治
D. 冷水沖洗約30分鐘

正確答案：B. 給予烤燈避免低體溫